Clinical trial exclusion criterion:
Age less than 18 years

Annotated entities:
- Person: "Age"
- Value: "less than 18 year"